Clinical trial inclusion criterion:
treated hypertension

Annotated entities:
- Condition: "hypertension"
- Qualifier: "treated"